Clinical trial inclusion criterion:
Signed informed consent form.

Annotated entities:
- Informed_consent: "Signed informed consent form"